下列敘述何者正確？
A. 通常利用形態學，即可鑑別寄生於人體的利什曼原蟲之種類
B. 動物異體接種診斷法（xenodiagnosis）常用以診斷陰道滴蟲症
C. 利什曼原蟲在宿主的巨噬細胞中以無鞭毛體（amastigotes）分裂增殖
D. 慢性感染巴西利什曼原蟲症者，常易造成耳部缺損，謂之採膠工瘍（chiclero ulcer）

正確答案：C. 利什曼原蟲在宿主的巨噬細胞中以無鞭毛體（amastigotes）分裂增殖